Clinical trial inclusion criterion:
Age = 19 and = 70 years;

Entity relations:
- Has_value("Age", "= 19 and = 70 years")